Clinical trial exclusion criterion:
Other neuromuscular disease

Annotated entities:
- Condition: "neuromuscular disease"